Clinical trial exclusion criterion:
have a pacemaker

Annotated entities:
- Device: "pacemaker"